Clinically significant, symptomatic cardiovascular disease, New York Heart Association (NYHA) Grade II or greater congestive heart failure, serious cardiac arrhythmia, Grade II or greater peripheral vascular disease, or history of major heart surgery within 6 months of Day 1, or any situation that would likely limit compliance with study requirements

The above is a clinical trial exclusion criterion. Annotated with entity spans:
[Qualifier: Clinically significant], [Qualifier: symptomatic] [Condition: cardiovascular disease], [Measurement: New York Heart Association (NYHA)] [Value: Grade II or greater] [Condition: congestive heart failure], [Qualifier: serious] [Condition: cardiac arrhythmia], [Value: Grade II or greater] [Condition: peripheral vascular disease], or [Temporal: history of] [Qualifier: major] [Procedure: heart surgery] [Temporal: within 6 months of Day 1], or any situation that would likely [Observation: limit compliance] with study requirements